A medication for apathy is appropriate, in the opinion of the study physician

The above is a clinical trial inclusion criterion. Annotated with entity spans:
[Post-eligibility: A medication for apathy is appropriate, in the opinion of the study physician]